Clinical trial exclusion criterion:
Any stroke within 6 months before randomization

Annotated entities:
- Condition: "stroke"
- Temporal: "within 6 months before randomization"